有些蛋白質係由多條獨立的多肽鏈（或稱蛋白次單元）組合而成，這些次單元在三度空間中的排列方式稱為蛋白質的：
A. 二級結構（Secondary structure）
B. 超二級結構（Supersecondary structure）
C. 三級結構（Tertiary structure）
D. 四級結構（Quaternary structure）

正確答案：D. 四級結構（Quaternary structure）